Clinical trial inclusion criterion:
between 7 to 70 years of age

Annotated entities:
- Value: "between 7 to 70 years"
- Person: "age"